Which bacteria are enriched in the gut microbiome of infants following exposure to fury pets?

Pre- and postnatal pet exposure enriched the abundance of Oscillospira and/or Ruminococcus in infants.